El medio no selectivo comúnmente usado para el crecimiento del gonococo (Neisseria gonorrhoeae) es el:
1. Agar chocolate.
2. Agar sangre.
3. Agar manitol salino.
4. Agar nutritivo.
5. Agar MacConkey.

Respuesta correcta: 1. Agar chocolate.